The drug JTV519 is derivative of which group of chemical compounds?

JTV519 (K201), is a 1,4-benzothiazepine derivative and multi-channel blocker, which has been found to stabilize RyR2s and decrease SR Ca²⁺ leak.